Clinical trial exclusion criterion:
ventral hernia repair with mesh

Annotated entities:
- Condition: "ventral hernia"
- Procedure: "repair with mesh"